Clinical trial exclusion criterion:
Patients with the risk factors for bowel obstruction or bowel perforation (examples include but not limited to a history of acute diverticulitis, intra-abdominal abscess, abdominal carcinomatosis).

Annotated entities:
- Condition: "bowel obstruction"
- Condition: "bowel perforation"
- Condition: "risk factors for bowel obstruction"
- Condition: "risk factors for bowel perforation"
- Temporal: "history"
- Condition: "acute diverticulitis"
- Condition: "intra-abdominal abscess"
- Condition: "abdominal carcinomatosis"